Chronic kidney disease

The above is a clinical trial exclusion criterion. Annotated with entity spans:
[Condition: Chronic kidney disease]